一位 20 歲男性發現有睪丸腫瘤，下列血液檢查何者是不需要的？
A. prostate specific antigen
B. α-fetoprotein
C. β-human chorionic gonadotropin
D. lactate dehydrogenase

正確答案：A. prostate specific antigen